Clinical trial exclusion criterion:
The patient does not require treatment with aspirin or any other antiplatelet agent

Annotated entities:
- Negation: "not"
- Mood: "require"
- Procedure: "treatment"
- Drug: "aspirin"
- Drug: "antiplatelet agent"
- Qualifier: "other"